Clinical trial inclusion criterion:
Uncomplicated RYGB performed minimum 3 months prior to the study.

Entity relations:
- Has_index("minimum 3 months prior to the study", "the study")
- Has_qualifier("RYGB", "Uncomplicated")
- Has_temporal("RYGB", "minimum 3 months prior to the study")